Clinical trial exclusion criterion:
Baseline hemogram with Hb<10g/dL or PLT count<100,000/μL

Entity relations:
- Has_temporal("hemogram", "Baseline")
- Has_value("Hb", "<10g/dL")
- Has_value("PLT count", "<100,000/μL")
- AND("hemogram", "Hb")
- OR("Hb", "PLT count")